male and female patients over the age of 18 years.

The above is a clinical trial inclusion criterion. Annotated with entity spans:
[Person: male] and [Person: female] patients [Value: over] the [Person: age] of 18 years.